Se ha aislado de E. coli una enzima desconocida que afecta al DNA. Cuando una solución de esta enzima se mezcla con DNA plásmido superenrollado, su único efecto es relajar al DNA. Al final de la exposición a la solución enzimática, el DNA plásmido está cerrado covalentemente y aún es circular. Esta enzima es una:
1. Endonucleasa de restricción.
2. Primasa.
3. Transcriptasa inversa.
4. Helicasa.
5. Topoisomerasa.

Respuesta correcta: 5. Topoisomerasa.